Clinical trial exclusion criteria:
latex allergy
non-reassuring fetal status
HIV
active herpes outbreak
Prior uterine scar
Contraindication to prostaglandins according to current Parkland protocol
Contraindication to vaginal delivery

Annotated entities:
- Condition: "allergy"
- Drug: "latex"
- Condition: "fetal status"
- Qualifier: "non-reassuring"
- Condition: "HIV"
- Condition: "herpes"
- Qualifier: "active"
- Condition: "uterine scar"
- Condition: "Contraindication"
- Drug: "prostaglandins"
- Procedure: "Parkland protocol"
- Condition: "Contraindication"
- Procedure: "vaginal delivery"